Clinical trial exclusion criterion:
1. Justification: The use of certain medications or drugs can lower seizure threshold and is therefore contra-indicated for TMS.

Annotated entities:
- Parsing_Error: "1."
- Non-representable: "Justification: The use of certain medications or drugs can lower seizure threshold and is therefore contra-indicated for TMS."